在全身性紅斑狼瘡的患者身上會出現許多自體抗體，下列何者為非？
A. 抗核抗體（ANA）可以用來作為疾病初期的篩檢抗體
B. 抗 Sm（Smith）抗體在全身性紅斑狼瘡具有專一性，也可以拿來作為疾病嚴重性的指標
C. 也可能會出現血中免疫球蛋白升高的情形
D. 抗雙股 DNA（dsDNA）抗體是疾病嚴重性的重要指標

正確答案：B. 抗 Sm（Smith）抗體在全身性紅斑狼瘡具有專一性，也可以拿來作為疾病嚴重性的指標